Clinical trial inclusion criterion:
Trauma (including fractures)

Entity relations:
- Subsumes("Trauma", "fractures")